Greater than or 18 years of age

The above is a clinical trial inclusion criterion. Annotated with entity spans:
[Value: Greater than or 18 years] of [Person: age]